ASA>3

The above is a clinical trial exclusion criterion. Annotated with entity spans:
[Measurement: ASA][Value: >3]